Clinical trial exclusion criterion:
hormone ablation for 2 months prior to treatment or during treatment

Entity relations:
- Has_index("for 2 months prior to treatment", "treatment")
- Has_index("during treatment", "treatment")
- Has_temporal("hormone ablation", "for 2 months prior to treatment")
- OR("for 2 months prior to treatment", "during treatment")